根據美國精神醫學會的精神疾病診斷與統計手冊第四版（DSM-IV）的診斷標準，診斷恐慌症的恐慌 發作，必須有下列何種特徵？
A. 由特定事件所引發的強烈害怕反應
B. 反覆、無法預期的發作
C. 症狀通常會慢慢發生且會持續很久
D. 發作時會有懼曠現象，空曠地方會使害怕加劇

正確答案：B. 反覆、無法預期的發作